Signed consent form

The above is a clinical trial inclusion criterion. Annotated with entity spans:
[Non-query-able: Signed consent form]